Clinical trial exclusion criterion:
Excess alcohol intake (males: = 28 units/week, females: = 21 units/week. One unit of alcohol = 8 oz beer, 1 oz hard liquor or 4 oz wine).

Entity relations:
- Has_value("alcohol intake", "Excess")
- Has_value("males", "= 28 units/week")
- Has_value("females", "= 21 units/week")
- Subsumes("Excess", "males")
- OR("males", "females")